Clinical trial exclusion criterion:
not in menopause and not have hot flashes

Annotated entities:
- Negation: "not"
- Condition: "menopause"
- Negation: "not"
- Condition: "hot flashes"